Clinical trial exclusion criterion:
Prior treatment toxicities have not resolved to < Grade 2 according to NCI CTCAE Version 4.0 (except clinically insignificant toxicities such as alopecia).

Annotated entities:
- Context_Error: "Prior treatment toxicities have not resolved to < Grade 2 according to NCI CTCAE Version 4.0 (except clinically insignificant toxicities such as alopecia)."